肝臟裸區（bare area）的形成與下列何者相關？
A. 病變造成
B. 胃貼近此處
C. 膽囊貼近此處
D. 橫膈貼近此處

正確答案：D. 橫膈貼近此處